下列那一個神經-肌肉阻斷劑，在治療劑量下作用時間（duration of action）最短？
A. succinylcholine
B. cisatracurium
C. pancuronium
D. vecuronium

正確答案：A. succinylcholine